一位妊娠週數40週、出生體重3,500公克的新生兒，其出生之後的體重變化，下列何者最不正常？
A. 滿24小時體重為3,400公克
B. 滿48小時體重是3,400公克
C. 滿3天體重是3,100公克
D. 滿5天體重是3,200公克

正確答案：C. 滿3天體重是3,100公克